下列何者連接海綿竇（cavernous sinus）與橫竇（transverse sinus）？
A. 乙狀竇（sigmoid sinus）
B. 上岩竇（superior petrosal sinus）
C. 下岩竇（inferior petrosal sinus）
D. 直竇（straight sinus）

正確答案：B. 上岩竇（superior petrosal sinus）